Clinical trial exclusion criterion:
Continuous HAs of any kind (i.e., persistent daily HAs with no HA-free period less than 8 hours between attacks)

Annotated entities:
- Condition: "HAs"
- Qualifier: "Continuous"
- Qualifier: "persistent"
- Multiplier: "daily"
- Measurement: "HA-free period between attacks"
- Value: "less than 8 hours"
- Negation: "no"
- Condition: "HAs"